Clinical trial exclusion criterion:
Presence of contraindication to cervical cerclage.

Annotated entities:
- Condition: "contraindication"
- Procedure: "cervical cerclage"